Clinical trial inclusion criterion:
age 18 years or more

Entity relations:
- Has_value("age", "18 years or more")